Ritonavir (RTV) to cobicistat (COBI)/COBI-containing fixed-dose combination regimens

The above is a clinical trial inclusion criterion. Annotated with entity spans:
[Drug: Ritonavir (RTV)] to [Drug: cobicistat (COBI)]/[Procedure: COBI-containing fixed-dose combination regimens]